下列有關恐慌症（panic disorder）之敘述，何者錯誤？
A. 恐慌症雖然是陣發性發作，但是為一種慢性病
B. 使用過多的咖啡或尼古丁，會惡化恐慌的症狀
C. 可能併發憂鬱、酒精與物質濫用、強迫症
D. 恐慌症患者發生自殺的危險性不高

正確答案：D. 恐慌症患者發生自殺的危險性不高